Clinical trial exclusion criterion:
Contraindication for the use of corticosteroids or local anesthetics

Entity relations:
- AND("Contraindication", "corticosteroids")
- OR("corticosteroids", "local anesthetics")